Clinical trial exclusion criterion:
Cognitive behavioural therapy or additional psychotherapy in past four months

Entity relations:
- Has_qualifier("psychotherapy", "additional")
- OR("Cognitive behavioural therapy", "psychotherapy")